La anorgasmia:
1. Es más frecuente en mujeres que en hombres.
2. Es más frecuente en hombres que en mujeres.
3. Se da con frecuencia similar en hombres y mujeres.
4. Es el más frecuente de los trastornos masculinos.

Respuesta correcta: 1. Es más frecuente en mujeres que en hombres.